Patients with renal disease (documented glomerular filtration rate < 60mL/min/1.73m2)

The above is a clinical trial exclusion criterion. Annotated with entity spans:
Patients with [Condition: renal disease] (documented [Measurement: glomerular filtration rate] [Value: < 60mL/min/1.73m2])